Clinical trial exclusion criterion:
Radiotherapy within 14 days before enrollment (if the involved field is small, 7 days will be considered a sufficient interval between treatment and administration of the ixazomib.)

Entity relations:
- Has_temporal("involved field is small", "7 days")
- Has_temporal("Radiotherapy", "within 14 days before enrollment")
- OR("within 14 days before enrollment", "involved field is small")